Patient is unwilling to discontinue 5-alph reductase inhibitors 1 month after study treatment

The above is a clinical trial exclusion criterion. Annotated with entity spans:
[Non-query-able: Patient is unwilling to discontinue 5-alph reductase inhibitors 1 month after study treatment]